Clinical trial exclusion criterion:
Patients with complex antibody profile in which it is impossible to match RBC units

Annotated entities:
- Condition: "complex antibody profile"
- Observation: "impossible to match RBC units"